Baseline DAS28/Erythrocyte Sedimentation Rate (ESR) >=3.2

The above is a clinical trial inclusion criterion. Annotated with entity spans:
[Temporal: Baseline] [Measurement: DAS28/Erythrocyte Sedimentation Rate (ESR)] [Value: >=3.2]